Los fármacos inhibidores de la bomba de protones son útiles en el tratamiento de:
1. Estreñimiento.
2. Úlcera corneal.
3. Úlcera péptica.
4. Diarrea del viajero.
5. Enfermedad de Crohn.

Respuesta correcta: 3. Úlcera péptica.